10. History of alcohol abuse or other substance abuse within the last year.

The above is a clinical trial exclusion criterion. Annotated with entity spans:
10. History of [Condition: alcohol abuse] or other [Condition: substance abuse] [Temporal: within the last year].